Known renal function disorders (MDRD <ô0)

The above is a clinical trial exclusion criterion. Annotated with entity spans:
Known [Condition: renal function disorders] ([Measurement: MDRD] [Value: <ô0])